車禍頸部受傷，造成右手拇指感覺喪失，其餘四指正常，最可能是右側那一條頸部脊神經受損？
A. C5
B. C6
C. C7
D. C8

正確答案：B. C6